Clinical trial inclusion criterion:
Clinically significant disease defined as at least 1 painful episode per year averaged over the previous 3 years or a history of priapism, stroke, acute chest syndrome, avascular necrosis, multi-organ failure or the need for chronic narcotic medications for pain from sickle cell disease

Annotated entities:
- Qualifier: "Clinically significant"
- Condition: "Clinically significant disease"
- Multiplier: "per year averaged over the previous 3 years at least 1"
- Condition: "painful episode"
- Temporal: "the previous 3 years"
- Qualifier: "averaged over the previous 3 years"
- Temporal: "history"
- Condition: "priapism"
- Condition: "stroke"
- Condition: "acute chest syndrome"
- Condition: "avascular necrosis"
- Condition: "multi-organ failure"
- Mood: "need for"
- Multiplier: "chronic"
- Qualifier: "chronic"
- Drug: "narcotic medications"
- Condition: "pain"
- Condition: "sickle cell disease"